All pacing capture thresholds (PCT) do not exceed 2.0 V @0.4 or 0.5 ms in pacemaker dependent patients

The above is a clinical trial inclusion criterion. Annotated with entity spans:
All [Measurement: pacing capture thresholds] ([Measurement: PCT]) [Value: do not exceed 2.0 V @0.4 or 0.5 ms] in [Condition: pacemaker dependent] patients